Creatinine clearance < 30 mL/min

The above is a clinical trial exclusion criterion. Annotated with entity spans:
[Measurement: Creatinine clearance] [Value: < 30 mL/min]